Clinical trial inclusion criterion:
Previous pregnancy complicated by gestational diabetes

Entity relations:
- AND("pregnancy", "gestational diabetes")